Clinical trial exclusion criterion:
Received radiation to more than 10% of bone.

Annotated entities:
- Procedure: "radiation"
- Value: "more than 10%"
- Qualifier: "bone"